Clinical trial exclusion criteria:
Women did not have breast cancer
do not use tamoxifen or aromatase inhibitor
not in menopause and not have hot flashes

Annotated entities:
- Negation: "not"
- Condition: "breast cancer"
- Drug: "tamoxifen"
- Drug: "aromatase inhibitor"
- Negation: "not"
- Negation: "not"
- Condition: "menopause"
- Negation: "not"
- Condition: "hot flashes"